Clinical trial inclusion criteria:
HIV controlled on therapy for at least 12 weeks
Viral load < 200 copies
BMI >27 to 45
Diagnosis of DM type 2 with A1-C >7 to 15
Participants must be willing to comply with all study related procedures

Annotated entities:
- Condition: "HIV"
- Qualifier: "controlled"
- Temporal: "at least 12 weeks"
- Measurement: "Viral load"
- Value: "< 200 copies"
- Person: "BMI"
- Value: ">27 to 45"
- Condition: "DM type 2"
- Measurement: "A1-C"
- Value: ">7 to 15"
- Post-eligibility: "Participants must be willing to comply with all study related procedures"